Clinical trial inclusion criterion:
Endoscopic and histological confirmed diagnosis of intestinal metaplasia,

Annotated entities:
- Qualifier: "histological confirmed"
- Qualifier: "Endoscopic confirmed"
- Condition: "intestinal metaplasia"
- Procedure: "histological"
- Procedure: "Endoscopic"